Clinical trial exclusion criteria:
patient not previously scheduled for radiofrequency ablation of the cervical, thoracic, or lumbar facets, or sacroiliac joints
on anticoagulation
have a pacemaker
age less than 18 years old
non-English speaking

Annotated entities:
- Negation: "not"
- Temporal: "previously"
- Mood: "scheduled for"
- Procedure: "radiofrequency ablation"
- Qualifier: "cervical facets"
- Qualifier: "thoracic facets"
- Qualifier: "lumbar facets"
- Qualifier: "sacroiliac joints"
- Procedure: "anticoagulation"
- Drug: "anticoagulation"
- Device: "pacemaker"
- Person: "age"
- Value: "less than 18 years old"
- Observation: "English speaking"
- Negation: "non"